Clinical trial exclusion criterion:
Other conditions that would limit clinical assessment of outcomes (e.g. dementia, demyelinating disease, autoimmune disease, etc)

Annotated entities:
- Condition: "dementia"
- Condition: "demyelinating disease"
- Condition: "autoimmune disease"